Hospitalization for major surgery including but not limited to abdominal, thoracic, or cardiovascular surgery within the past 3 months prior to screening, or for a clinically significant non-surgical illness, based on Investigator judgment, within the past 3 months.

The above is a clinical trial exclusion criterion. Annotated with entity spans:
[Procedure: Hospitalization] for [Qualifier: major] [Procedure: surgery] including but not limited to [Procedure: abdominal], [Procedure: thoracic], or [Procedure: cardiovascular surgery] [Temporal: within the past 3 months prior to screening], or for a [Qualifier: clinically significant] [Condition: non-surgical illness], [Subjective_judgement: based on Investigator judgment], [Temporal: within the past 3 months].